Clinical trial exclusion criterion:
Acute ST-segment-elevation myocardial infarction (STEMI)

Annotated entities:
- Condition: "Acute ST-segment-elevation myocardial infarction"
- Condition: "STEMI"